Clinical trial exclusion criterion:
Drivers and dangerous machine operators

Entity relations:
- OR("Drivers", "dangerous machine operators")